Clinical trial inclusion criterion:
Patient proficient into filling out the questionnaires.

Annotated entities:
- Post-eligibility: "Patient proficient into filling out the questionnaires."
- Non-query-able: "Patient proficient into filling out the questionnaires."